Clinical trial exclusion criteria:
Subjects with evidence of liver cirrhosis
Evidence of HCC
Co-infection with hepatitis B virus, HIV

Annotated entities:
- Condition: "liver cirrhosis"
- Mood: "evidence"
- Condition: "HCC"
- Mood: "Evidence"
- Condition: "hepatitis B virus"
- Condition: "HIV"